下列關於胰臟發育之敘述，何者正確？
A. 由前腸（foregut）及中腸（midgut）共同衍生而來
B. 大部分由背胰芽（dorsal pancreatic bud）衍生而來
C. 腹胰芽（ventral pancreatic bud）發育較背胰芽早
D. 背胰芽轉至腹面與腹胰芽癒合

正確答案：B. 大部分由背胰芽（dorsal pancreatic bud）衍生而來